Clinical trial exclusion criterion:
Previous biliary drainage by ERCP/PTC

Annotated entities:
- Procedure: "biliary drainage by ERCP/PTC"
- Temporal: "Previous"